What is the function of the protein encoded by the gene NKCC2?

The protein function as an Na-K-Cl cotransporter.